Clinical trial exclusion criterion:
Patients with a history of drug abuse;

Annotated entities:
- Condition: "drug abuse"
- Temporal: "history"